Clinical trial exclusion criterion:
on anticoagulation

Annotated entities:
- Procedure: "anticoagulation"
- Drug: "anticoagulation"